Scheduled cardiac resynchronization therapy or heart transplantation.

The above is a clinical trial exclusion criterion. Annotated with entity spans:
Scheduled [Procedure: cardiac resynchronization therapy] or [Procedure: heart transplantation].